List types of mutations.

point mutations
deletions
insertions
inversions
translocations